What datasets are available related to Duchenne Muscular Dystrophy?

Using data from the Muscular Dystrophy Surveillance, Tracking, and Research Network (MD STARnet). Five sources of RWD/NHD were contributed by Universitaire Ziekenhuizen Leuven, DMD Italian Group, The Cooperative International Neuromuscular Research Group, ImagingDMD, and the PRO-DMD-01 study.